下列各項有關炭疽病（anthrax）之敘述，何者最適當？
A. 吸入型炭疽病（inhalational anthrax）潛伏期為1至2天
B. 容易造成人與人之間的傳播
C. 在吸入型炭疽病，其胸部Ｘ光特徵為縱膈腔（mediastinum）變寬及肋膜積水
D. 在暴露後，預防性抗生素使用（postexposure prophylaxis）建議使用14天的ciprofloxacin 或doxycycline

正確答案：C. 在吸入型炭疽病，其胸部Ｘ光特徵為縱膈腔（mediastinum）變寬及肋膜積水